La actividad de corrección de pruebas de la ADN Polimerasa es una actividad:
1. Exonucleasa 5´-3´.
2. Exonucleasa 3´-5´.
3. Polimerizante 5´-3´.
4. Endonucleasa.
5. Transesterificadora.

Respuesta correcta: 2. Exonucleasa 3´-5´.